Clinical trial exclusion criterion:
Any new or definitely enlarging T2/FLAIR lesion or new gadolinium-enhancing lesion within the past three years (at least two scans separated by at least three years must be reviewed) on brain or spine MRI scan. Lesions must be 3mm or larger to be exclusionary.

Annotated entities:
- Condition: "T2/FLAIR lesion"
- Drug: "gadolinium"
- Qualifier: "gadolinium-enhancing"
- Condition: "lesion"
- Temporal: "within the past three years"
- Multiplier: "at least two"
- Procedure: "scans"
- Temporal: "separated by at least three years"
- Procedure: "spine MRI scan"
- Procedure: "brain MRI scan"
- Qualifier: "3mm or larger"
- Condition: "Lesions"